將離子載體（ionophore），如纈氨黴素（Valinomycin），加至原核細胞懸浮液，該細胞之膜離子梯度（transmembrane ion gradients）會有下列何種變化？
A. 離子梯度增加
B. 離子梯度減少
C. 離子梯度沒有任何改變
D. 離子梯度無法預期是否會改變

正確答案：B. 離子梯度減少